Clinical trial inclusion criterion:
written informed consent of both parents

Annotated entities:
- Informed_consent: "written informed consent of both parents"